下列有關postobstructive diuresis的敘述，何者錯誤？
A. 發生在雙側或單側尿路完全阻塞，經過成功疏通的病人
B. 尿液為低張含大量鹽分，可能導致高血鈉
C. 致病機轉為排泄先前滯留體內的尿素，產生滲透壓利尿（osmotic diuresis）
D. 靜脈輸液治療不宜補充＞每日尿液流失量，以免發生醫源性體液容積增加

正確答案：A. 發生在雙側或單側尿路完全阻塞，經過成功疏通的病人